Clinical trial inclusion criterion:
Subjects are dapsone-naive.

Annotated entities:
- Drug: "dapsone"
- Negation: "naive"